Clinical trial exclusion criterion:
10. History of DVT or pulmonary embolism within 6 months;

Entity relations:
- Has_temporal("pulmonary embolism", "within 6 months")
- Has_temporal("DVT", "History")
- OR("DVT", "pulmonary embolism")